下列有關近視（myopia）的敘述何者正確？
A. 遠方物體的影像聚焦於視網膜（retina）的前方
B. 可用凸透鏡片（convex lens）協助矯正視力
C. 水晶體（lens）對近距離影像的調節（accommodation）有缺陷
D. 近視患者不會罹患老花眼（presbyopia）

正確答案：A. 遠方物體的影像聚焦於視網膜（retina）的前方